Intention to deliver in a maternity not linked to the study

The above is a clinical trial exclusion criterion. Annotated with entity spans:
[Post-eligibility: Intention to deliver in a maternity not linked to the study]